El trabajo de expansión de un gas (W):
1. Es una función de estado.
2. Equivale al calor asociado al proceso (Q).
3. Contra presión constante se calcula con W = -Pext ΔV.
4. En un proceso isotérmico reversible se calcula con W = -nRTΔV.
5. Equivale al cambio de energía interna durante el proceso (ΔU)

Respuesta correcta: 3. Contra presión constante se calcula con W = -Pext ΔV.